Clinical trial exclusion criterion:
Hypersensitivity, including allergy, to any component of vaccines, medicinal products or medical equipment whose use is foreseen in this study.

Annotated entities:
- Condition: "Hypersensitivity"
- Condition: "allergy"
- Drug: "component of vaccines"
- Drug: "medicinal products"
- Device: "medical equipment"
- Qualifier: "whose use is foreseen in this study"